FEV1 >= 80% or FEV1 < 20% of predicted value post-bronchodilator.

The above is a clinical trial exclusion criterion. Annotated with entity spans:
[Measurement: FEV1] [Value: >= 80%] or [Measurement: FEV1] [Value: < 20% of predicted value] [Qualifier: post-bronchodilator].